History of severe allergic reactions attributed to compounds of similar chemical or biologic composition to rituximab or other agents used in this study.

The above is a clinical trial exclusion criterion. Annotated with entity spans:
History of [Qualifier: severe] [Condition: allergic reactions] attributed to [Undefined_semantics: compounds of similar chemical or biologic composition to rituximab or other agents used in this study].